follow-up is inadequate

The above is a clinical trial exclusion criterion. Annotated with entity spans:
[Observation: follow-up is inadequate]